Clinical trial exclusion criterion:
6. History of pneumonitis or interstitial lung disease.

Entity relations:
- Has_temporal("pneumonitis", "History")
- Has_temporal("interstitial lung disease", "History")
- OR("pneumonitis", "interstitial lung disease")